Clinical trial exclusion criterion:
Myocardial infarction within the previous 6 months

Entity relations:
- Has_temporal("Myocardial infarction", "within the previous 6 months")